singleton, term pregnancy

The above is a clinical trial inclusion criterion. Annotated with entity spans:
[Qualifier: singleton], [Qualifier: term] [Condition: pregnancy]